下列那些荷爾蒙會降低肌肉蛋白質的合成？
A. Glucocorticoids
B. Insulin
C. Growth hormone
D. Thyroid hormone

正確答案：A. Glucocorticoids